16歲年輕女性，因下腹疼痛及腹圍增加至門診求診，月經週期約28天，最近兩個月有異常出血，超音波顯示左側卵巢複雜性腫瘤，抽血檢查發現beta-hCG，CA-125及LDH都在正常值，但AFP值為1,236 ng/mL。下列 敘述何者正確？
A. 患者最可能是上皮性卵巢癌，須子宮及雙側卵巢輸卵管全切除
B. 患者最可能是卵巢內胚層竇瘤（endodermal sinus tumors），對化學治療很敏感
C. 此腫瘤對放射線治療很敏感，術後往往要加做放射線合併化學治療
D. 在年輕女性惡性卵巢腫瘤中很少見

正確答案：B. 患者最可能是卵巢內胚層竇瘤（endodermal sinus tumors），對化學治療很敏感